40歲男性因肝硬化接受肝臟移植，移植手術過程順利，目前服用抗排斥藥。則肝臟移植急性排斥主要病理變化之描述，下列何者錯誤？
A. 急性排斥常在術後前兩個月內發生
B. 門脈區、中心靜脈區發炎，內皮細胞腫脹
C. 膽小管被破壞
D. 細胞浸潤主要在門脈區，以多形核白血球為主

正確答案：D. 細胞浸潤主要在門脈區，以多形核白血球為主